Clinical trial inclusion criterion:
Undergoing elective, primary and unilateral total knee arthroplasty

Entity relations:
- Has_qualifier("total knee arthroplasty", "unilateral")
- Has_qualifier("total knee arthroplasty", "primary")
- Has_qualifier("total knee arthroplasty", "elective")